當肺內某處的細支氣管（bronchiole）被異物阻塞時，會發生下列何種反應？
A. 進入此區肺泡（alveolus）之通氣量（ventilation）增加
B. 進入此區肺泡（alveolus）之血液灌流量（perfusion）增加
C. 此區通氣量（ventilation）與血液灌流量（perfusion）之比值會改變，隨後恢復到與其它正常區域相近
D. 鄰近的血管舒張（vasodilation）

正確答案：C. 此區通氣量（ventilation）與血液灌流量（perfusion）之比值會改變，隨後恢復到與其它正常區域相近